any intraocular surgery within the previous 12 months.

The above is a clinical trial exclusion criterion. Annotated with entity spans:
any [Procedure: intraocular surgery] [Temporal: within the previous 12 months].